Clinical trial exclusion criterion:
Cervical dilatation > 4 cm

Annotated entities:
- Measurement: "Cervical dilatation"
- Value: "> 4 cm"